一位 19 歲女孩就診時抱怨近來寫字及穿衣時有困難，理學檢查發現眼鞏膜有 Kayser-Fleischer 氏環及黃疸，血液檢查發現 ALT 及 AST 值有輕微昇高，而 ceruloplasmin 值下降，24 小時尿液銅離子排泄增加。下列何項為最適當之診斷？
A. 原發性膽管性肝硬化（Primary biliary cirrhosis）
B. 威爾遜氏病（Wilson's disease）
C. 血色素沉著症（Hemochromatosis）
D. 威氏病（Weil's disease）

正確答案：B. 威爾遜氏病（Wilson's disease）